Clinical trial inclusion criteria:
Postmenopausal women
Age 60-80 years
T-score according to DXA: <-2.5
indication for osteoporosis therapy according to international guidelines

Annotated entities:
- Condition: "Postmenopausal"
- Person: "women"
- Person: "Age"
- Value: "60-80 years"
- Measurement: "T-score"
- Procedure: "DXA"
- Qualifier: "according to DXA"
- Value: "<-2.5"
- Mood: "indication for"
- Procedure: "osteoporosis therapy"
- Condition: "osteoporosis"
- Qualifier: "international guidelines"